75歲林先生，平時有失智症及糖尿病，偶而失眠。這幾天突然不講話，且有尿失禁現象，家屬起初不以為意，三日後狀況惡化，帶至急診室，經診斷為肺炎，下列敘述何者正確？
A. 林先生沒有老年病症候群
B. 林先生之表現為失智症惡化造成
C. 林先生可能有醫源性問題
D. 林先生一開始之表現為非典型表現

正確答案：D. 林先生一開始之表現為非典型表現